Clinical trial exclusion criterion:
Current use of Amiodarone (Cordarone)

Annotated entities:
- Drug: "Amiodarone"
- Drug: "Cordarone"
- Temporal: "Current"